Any diabetic macular edema treatment in the past 4 months

The above is a clinical trial exclusion criterion. Annotated with entity spans:
Any [Condition: diabetic macular edema] [Procedure: treatment] [Temporal: in the past 4 months]